Patients diagnosed severe sepsis / septic shock at admission on Intensive Care Unit who can be enrolled within 90 min after admission OR patients diagnosed severe sepsis / septic shock during Intensive Care Unit stay who can be enrolled within 90 min after diagnosis

The above is a clinical trial inclusion criterion. Annotated with entity spans:
Patients diagnosed [Condition: severe sepsis] / [Condition: septic shock] [Temporal: at admission on Intensive Care Unit] who can [Non-representable: be enrolled within 90 min after admission] OR patients diagnosed severe sepsis / septic shock during Intensive Care Unit stay who can be enrolled within 90 min after diagnosis